Clinical trial exclusion criterion:
unstable condition, COPD exacerbation

Entity relations:
- Has_qualifier("condition", "unstable")
- OR("condition", "COPD exacerbation")